Clinical trial exclusion criterion:
Inability to refrain from NSAID use for 5 days prior to and 6 weeks after injection

Annotated entities:
- Drug: "NSAID"
- Temporal: "5 days prior to and 6 weeks after injection"
- Reference_point: "injection"
- Mood: "Inability to refrain from"